Clinical trial inclusion criterion:
Patients receiving = 1 high or medium risk antibiotic for treatment of an infection other than CDI, for an anticipated duration of = 5 days from the time of enrollment.

Annotated entities:
- Non-query-able: "Patients receiving = 1 high or medium risk antibiotic for treatment of an infection other than CDI, for an anticipated duration of = 5 days from the time of enrollment."